Clinical trial exclusion criterion:
10. Chronic infections including, but not limited to tuberculosis (TB), hepatitis B virus (HBV) or hepatitis C virus (HCV).

Entity relations:
- Has_multiplier("infections", "Chronic")
- Subsumes("infections", "tuberculosis (TB)")
- OR("tuberculosis (TB)", "hepatitis C virus (HCV)", "hepatitis B virus (HBV)")